Clinical trial exclusion criterion:
Patient with health problems or a skin disease precluding continuous subcutaneous infusion

Annotated entities:
- Condition: "health problems"
- Condition: "skin disease"
- Negation: "precluding"
- Procedure: "continuous subcutaneous infusion"